Which signaling pathway is activating the dishevelled proteins?

Dishevelled (Xdsh) controls cell fate via canonical Wnt signaling